Clinical trial inclusion criterion:
Patients with current or recent history of malignancy or infectious disease.

Annotated entities:
- Temporal: "recent"
- Temporal: "current"
- Temporal: "history"
- Condition: "malignancy"
- Condition: "infectious disease"